List human antibody isotypes.

IgA
IgE
IgG
IgM
IgD